Life expectancy <1 year due to comorbidity

The above is a clinical trial exclusion criterion. Annotated with entity spans:
[Observation: Life expectancy] [Value: <1 year] due to [Condition: comorbidity]